Affected by alcohol or drugs during the last month.

The above is a clinical trial exclusion criterion. Annotated with entity spans:
Affected by [Observation: alcohol] or [Observation: drugs] during the [Temporal: last month].